Clinical trial inclusion criterion:
Willing to undergo second eye surgery within 7 days after first eye surgery;

Annotated entities:
- Non-query-able: "Willing to undergo second eye surgery within 7 days after first eye surgery;"